Patient has experienced lower urinary tract symptoms (LUTS) for at least 6 months prior to study enrollment

The above is a clinical trial inclusion criterion. Annotated with entity spans:
Patient has experienced [Condition: lower urinary tract symptoms (LUTS)] for [Temporal: at least 6 months prior to study enrollment]